Diagnosed with secondary hypertension or suspected of secondary hypertension [e.g., renovascular disease, adrenal medullary and cortical hyperfunction, coarctation of the aorta, hyperaldosteronism, unilateral or bilateral renal artery stenosis, Cushing's syndrome, pheochromocytoma, polycystic kidney disease, etc.]

The above is a clinical trial exclusion criterion. Annotated with entity spans:
Diagnosed with [Qualifier: secondary] [Condition: hypertension] or [Mood: suspected] of [Qualifier: secondary] [Condition: hypertension] [e.g., [Condition: renovascular disease], [Condition: adrenal medullary] and [Condition: cortical hyperfunction], [Condition: coarctation of the aorta], [Condition: hyperaldosteronism], [Qualifier: unilateral] or [Qualifier: bilateral] [Condition: renal artery stenosis], [Condition: Cushing's syndrome], [Condition: pheochromocytoma], [Condition: polycystic kidney disease], etc.]